Clinical trial exclusion criterion:
Known major cognitive deficit dementia, history of head trauma with loss of consciousness >30 min, history of stroke, current central nervous system (CNS) disorder such as seizures or opportunistic CNS infection

Annotated entities:
- Condition: "dementia"
- Condition: "cognitive deficit"
- Condition: "head trauma"
- Condition: "loss of consciousness"
- Multiplier: ">30 min"
- Condition: "stroke"
- Condition: "central nervous system disorder"
- Condition: "seizures"
- Condition: "opportunistic CNS infection"